Clinical trial exclusion criterion:
Hospitalization for acute decompensated HF within previous 30 days

Annotated entities:
- Observation: "Hospitalization"
- Condition: "acute decompensated HF"
- Temporal: "within previous 30 days"